BMI > 30

The above is a clinical trial exclusion criterion. Annotated with entity spans:
[Measurement: BMI] [Value: > 30]